Westley croup score between 3 and 11

The above is a clinical trial inclusion criterion. Annotated with entity spans:
[Measurement: Westley croup score] [Value: between 3 and 11]